Clinical trial exclusion criterion:
Major surgical procedure, open biopsy, or significant traumatic injury within 4 weeks prior to Day 1, or anticipation of need for major surgical procedure during the course of the study

Annotated entities:
- Qualifier: "Major"
- Procedure: "surgical procedure"
- Procedure: "open biopsy"
- Qualifier: "significant"
- Condition: "traumatic injury"
- Temporal: "within 4 weeks prior to Day 1"
- Reference_point: "Day 1"
- Mood: "anticipation of need"
- Qualifier: "major"
- Procedure: "surgical procedure"
- Temporal: "during the course of the study"
- Reference_point: "the study"